下列那些因素可導致腹腔靜脈壓（venous pressure）之增加？①靜脈的順應性（venous compliance）增加 ②投射至靜脈的交感神經活性（sympathetic activity）增加 ③吸氣活動（inspiration movements） ④全身血量（blood volume）增加
A. ①②③
B. ①②④
C. ②③④
D. ①③④

正確答案：C. ②③④